Clinical trial exclusion criterion:
currently use ventilator

Annotated entities:
- Temporal: "currently"
- Procedure: "ventilator"